Clinical trial exclusion criterion:
Pre-existing hemoptysis of a severity > grade 3 by NCI CTCAE criteria within 4 weeks prior to study entry

Entity relations:
- Has_value("severity", "> grade 3")
- AND("severity", "NCI CTCAE criteria")
- Has_index("within 4 weeks prior to study entry", "study entry")